Clinical trial exclusion criterion:
Clinically significant cardiovascular disease (including myocardial infarction, unstable angina, symptomatic congestive heart failure, serious uncontrolled cardiac arrhythmia) <=6 months prior to enrolment.

Entity relations:
- Has_qualifier("congestive heart failure", "symptomatic")
- Has_qualifier("cardiac arrhythmia", "uncontrolled")
- Has_qualifier("cardiac arrhythmia", "serious")
- Has_index("<=6 months prior to enrolment", "enrolment")
- Subsumes("Clinically significant", "myocardial infarction")
- Has_temporal("Clinically significant", "<=6 months prior to enrolment")
- OR("myocardial infarction", "unstable angina", "congestive heart failure", "cardiac arrhythmia")
- OR("Clinically significant", "cardiovascular disease")